Clinical trial inclusion criterion:
Age over 18 years,

Annotated entities:
- Person: "Age"
- Value: "over 18 years"